Clinical trial exclusion criterion:
Known platelet count <80x106/mL

Annotated entities:
- Measurement: "platelet count"
- Value: "<80x106/mL"